Clinical trial inclusion criteria:
Patients who have non muscle invasive bladder cancer male patients patients between 40-80 years old

Annotated entities:
- Condition: "non muscle invasive bladder cancer"
- Person: "old"
- Value: "between 40-80 years"
- Person: "male"